Zollinger-Ellison syndrome or primary esophageal motility disorders

The above is a clinical trial exclusion criterion. Annotated with entity spans:
[Condition: Zollinger-Ellison syndrome] or [Condition: primary esophageal motility disorders]